Clinical trial exclusion criterion:
Moderate or severe endometriosis.

Annotated entities:
- Qualifier: "Moderate"
- Qualifier: "severe"
- Condition: "endometriosis"